Clinical trial exclusion criterion:
planned surgical duration more than 3 hours

Annotated entities:
- Measurement: "planned surgical duration"
- Value: "more than 3 hours"